Clinical trial exclusion criterion:
Severe pelvic organ prolapse or prolapse to any degree that may prevent retention of the vaginal ring after insertion

Annotated entities:
- Qualifier: "Severe"
- Condition: "pelvic organ prolapse"
- Condition: "prolapse"
- Qualifier: "may prevent retention of the vaginal ring after insertion"